Current treatment with Telbivudine

The above is a clinical trial exclusion criterion. Annotated with entity spans:
Current treatment with [Drug: Telbivudine]